Clinical trial exclusion criterion:
Active peptic ulceration or gastrointestinal bleeding.

Entity relations:
- Has_temporal("peptic ulceration", "Active")
- OR("peptic ulceration", "gastrointestinal bleeding")